Cardiogenic shock, ventricular arrhythmia or resuscitated cardiac arrest

The above is a clinical trial exclusion criterion. Annotated with entity spans:
[Condition: Cardiogenic shock], [Condition: ventricular arrhythmia] or [Qualifier: resuscitated] [Condition: cardiac arrest]